2. Screening tool: physical assessment (EKG), medical history.

The above is a clinical trial exclusion criterion. Annotated with entity spans:
[Parsing_Error: 2.] [Parsing_Error: Screening tool: physical assessment (EKG), medical history.]